使用甲型交感神經抑制劑（alpha-adrenergic blockers）治療攝護腺肥大，下列何者不是常見的副作用？
A. 頭暈（dizziness）
B. 姿勢性低血壓（postural hypotension）
C. 疲倦感（tiredness）
D. 心跳過慢（bradycardia）

正確答案：D. 心跳過慢（bradycardia）